在臨床實驗欲評估三組藥物降血壓數值何種藥物最有效果，可利用何種檢定方法最適當？
A. 卡方檢定
B. 變異數分析
C. 適合度檢定
D. 配對 t 檢定

正確答案：B. 變異數分析